What is "Epitranscriptome analysis"?

Modified nucleotides in messenger RNA (mRNA) have been discovered over 40 years ago, but until recently little was known about which transcripts contain them and what their function is. High-throughput sequencing approaches revealed a dynamic landscape of the 'Epitranscriptome' for many mRNA modifications in various organisms from yeast to humans.		
The detection methods of RNA modifications has enabled investigation of a new layer of gene regulation - the epitranscriptome.